allergy to metformin

The above is a clinical trial exclusion criterion. Annotated with entity spans:
[Condition: allergy] to [Drug: metformin]